Clinical trial exclusion criterion:
17. Active, uncontrolled infection

Entity relations:
- Has_qualifier("infection", "uncontrolled")
- Has_temporal("infection", "Active")